兩歲以內之小兒疝氣修補術最廣泛使用的術後止痛方式為：
A. 尾椎阻斷（caudal block）
B. 硬脊膜外阻斷（epidural block）
C. 病患自控止痛（patient-controlled analgesia）
D. 嗎啡類止痛劑（opioid analgesics）

正確答案：A. 尾椎阻斷（caudal block）